Clinical trial inclusion criterion:
History of taking an alpha blocker (tamsulosin/ terazosin/doxazosin/alfuzosin/silodosin) medication

Entity relations:
- Subsumes("alpha blocker", "tamsulosin")
- OR("tamsulosin", "terazosin", "doxazosin", "alfuzosin", "silodosin")